Clinical trial inclusion criterion:
Persistent dyspnea on daily life (Baseline Dyspnea Index focal score <or= 8).

Entity relations:
- Has_temporal("dyspnea on daily life", "Persistent")
- Has_value("Dyspnea Index focal score", "<or= 8")
- Has_temporal("Dyspnea Index focal score", "Baseline")
- Subsumes("dyspnea on daily life", "Dyspnea Index focal score")